有一對夫婦生下一位有染色體構造異常（不平衡轉位）的小孩，醫師在詢問病史時發現母親已經有三次於懷孕早期自然流產。因此醫師決定要進行這對夫婦的染色體分析（他們都沒有智能不足或是先天性畸形的現象）。你覺得醫師對這對夫婦最可能的懷疑是下列何者？
A. 父母親之一或許有和小孩一樣的核型（karyotype），這樣就可以解釋他們的流產及異常的小孩
B. 父母親可能各帶有一半的染色體異常，小孩如果同時遺傳到兩種異常便會發病
C. 父母親其中一人可能有染色體平衡轉位
D. 父母親的染色體不合

正確答案：C. 父母親其中一人可能有染色體平衡轉位